En una placa de agar sangre, un halo verdoso o marrón alrededor de una colonia bacteriana indica que la bacteria produce:
1. Un sideróforo.
2. α hemolisis.
3. Coagulasa.
4. β galactosidasa.
5. Metabolitos neutros.

Respuesta correcta: 2. α hemolisis.